Clinical trial exclusion criterion:
Subjects who creatinine value is more than two times of the upper limit of the normal range at screening test

Entity relations:
- Has_index("at screening test", "screening test")
- Has_value("creatinine", "more than two times of the upper limit of the normal range")
- Has_temporal("creatinine", "at screening test")